La Sra. M. D. de 88 años, es dependiente para las actividades de la vida diaria. La enfermera que la visita recibe de ella la siguiente información: “mi hija se ocupa de mi todo el día, me lava, me viste y me da de comer, además busca tiempo para llevarme a tomar el aire. No comprendo cómo puede soportarlo, así tiene la espalda. La pobre ni siquiera tiene tiempo para salir con ese novio que se ha echado”. La enfermera verifica la información con su hija de 47 años, divorciada y con tres hijas de entre 16 y 22 años. Refiere “estar agotada de cuidar a su madre y muy preocupada por la implicación, cada vez mayor, de su hija mayor en el cuidado de la abuela y también frustrada porque no sabe si todo eso servirá para algo. En ocasiones se siente estar harta, sin tiempo nada ni si quiera de aburrirse”. Parece que el problema principal de la hija de M. D. es:
1. Cansancio del rol del cuidador.
2. Riesgo de deterioro parental.
3. Déficit de actividades recreativas.
4. Riesgo de intolerancia a la actividad.
5. Desesperanza.

Respuesta correcta: 1. Cansancio del rol del cuidador.